Clinical trial exclusion criterion:
Contraindication to adenosine stress test

Entity relations:
- AND("Contraindication", "adenosine stress test")